Señale cuál de las siguientes afirmaciones sobre el espacio muerto de la vía aérea es correcto:
1. Es el aire que ocupa la vía respiratoria y se emplea en el intercambio de gases.
2. En una persona adulta supone unos 3250 ml.
3. En cada ciclo respiratorio entra el aire del espacio muerto pobre en O2.
4. Es el área pulmonar que no es ventilada y por tanto no contiene gases.
5. Comprende las vías aéreas y los alvéolos que no participan en el intercambio de gas con la sangre.

Respuesta correcta: 5. Comprende las vías aéreas y los alvéolos que no participan en el intercambio de gas con la sangre.